What is amphiregulin a ligand of?

Amphiregulin (AREG) is an epidermal growth factor receptor (EGFR) ligand.